Clinical trial inclusion criterion:
Age between 31 and 60 years

Annotated entities:
- Person: "Age"
- Measurement: "between 31 and 60 years"